Be scheduled for trans-jugular liver biopsy the day of the ultrasound procedure.

The above is a clinical trial inclusion criterion. Annotated with entity spans:
Be scheduled for [Procedure: trans-jugular liver biopsy] [Temporal: the day of the ultrasound procedure].